Clinical trial exclusion criterion:
Hyperthyroidism, advanced arteriosclerosis, symptomatic cardiovascular disease, serious structural cardiac abnormalities, cardiomyopathy, serious heart rhythm abnormalities, or a family history of sudden death or death related to heart problems

Annotated entities:
- Condition: "Hyperthyroidism"
- Condition: "arteriosclerosis"
- Qualifier: "advanced"
- Condition: "cardiovascular disease"
- Qualifier: "symptomatic"
- Qualifier: "serious"
- Condition: "structural cardiac abnormalities"
- Condition: "cardiomyopathy"
- Condition: "heart rhythm abnormalities"
- Qualifier: "serious"
- Observation: "family history"
- Condition: "sudden death"
- Condition: "death related to heart problems"
- Qualifier: "related to heart problems"